Clinical trial exclusion criterion:
assumption of medication that interacts with Truvada®

Annotated entities:
- Non-query-able: "assumption of medication that interacts with Truvada"